Active or history of any clinically significant medical condition including renal, hepatic, pulmonary, gastrointestinal, cardiovascular, genitourinary, endocrine, immunologic, metabolic, neurologic, psychiatric or hematological disease, based on Investigator judgment.

The above is a clinical trial exclusion criterion. Annotated with entity spans:
[Temporal: Active] or [Temporal: history] of any [Qualifier: clinically significant] [Condition: medical condition] including renal, hepatic, pulmonary, gastrointestinal, cardiovascular, genitourinary, endocrine, immunologic, [Condition: metabolic], [Condition: neurologic], [Condition: psychiatric] or [Condition: hematological disease], [Qualifier: based on Investigator judgment].